Clinical trial inclusion criteria:
Need for long-term oral anticoagulation;
Patient has provided written informed consent.

Annotated entities:
- Mood: "Need for"
- Procedure: "long-term oral anticoagulation"
- Informed_consent: "Patient has provided written informed consent"